Clinical trial exclusion criterion:
lactating, pregnant or planning pregnancy

Annotated entities:
- Pregnancy_considerations: "actating, pregnant or planning pregnancy"